鍍銀法（silver impregnation）可將下列何種纖維染成黑色？
A. 網狀纖維
B. 彈性纖維
C. 骨骼肌纖維
D. 膠原纖維

正確答案：A. 網狀纖維